What systems have been developed for the numbering of antibody residues?

The most prevalent antibody numbering systems are the Kabat system, the Chothia system as well as the IMGT numbering system.